¿Cuál de las siguientes situaciones clínicas conlleva un mayor riesgo de progresión de la enfermedad renal crónica y requeriría un control más estricto por parte del nefrólogo?
1. Paciente diabético con un filtrado glomerular de     46    mL/min      y     un     cociente albumina/creatinina en orina de 25 mg/g.
2. Paciente diabético con filtrado glomerular de 89 mL/min y cociente albumina/creatinina en orina de 475 mg/g.
3. Paciente hipertenso con filtrado glomerular de 65 mL/min y cociente albumina/creatinina en orina de 150 mg/g.
4. Paciente hipertenso de 70 años con 1 quiste simple en cada riñón, filtrado glomerular de 35 mL/min y cociente albumina/creatinina en orina de 10 mg/g.
5. Paciente hipertenso de 87 años con filtrado glomerular de 30 mL/min y cociente albumina/creatinina en orina de 5 mg/g.

Respuesta correcta: 2. Paciente diabético con filtrado glomerular de 89 mL/min y cociente albumina/creatinina en orina de 475 mg/g.